Clinical trial exclusion criteria:
The patient is participating in another study
The patient is in an exclusion period determined by a previous study
The patient or his/her representative refuses to sign the consent
It is impossible to correctly inform the patient or his/her representative
The patient is pregnant or breastfeeding
The patient has a contraindication (or an incompatible drug association) for a treatment used in this study
The patient had a coronary stent for less than 12 months
The patient does not require treatment with aspirin or any other antiplatelet agent
The patient has a history of aspirin allergy
High bleeding risk; such as platelets <50,000 / mm3 during screening, Hb <8.5 g / dL, history of intracranial hemorrhage or subdural hematoma, major surgery, parenchymal organ biopsy or severe trauma within 30 days before inclusion, active gastrointestinal ulcer in the last 3 months;
History of Stroke in the last 3 months;
Moderate or severe liver affection associated with coagulopathy
Active infectious endocarditis
Active tumor treated at the time of inclusion associated with expected survival less than one year

Annotated entities:
- Competing_trial: "The patient is participating in another study"
- Non-query-able: "The patient is in an exclusion period determined by a previous study"
- Informed_consent: "The patient or his/her representative refuses to sign the consent"
- Post-eligibility: "It is impossible to correctly inform the patient or his/her representative"
- Pregnancy_considerations: "The patient is pregnant or breastfeeding"
- Condition: "contraindication"
- Non-representable: "The patient has a contraindication (or an incompatible drug association) for a treatment used in this study"
- Device: "coronary stent"
- Temporal: "less than 12 months"
- Negation: "not"
- Mood: "require"
- Procedure: "treatment"
- Drug: "aspirin"
- Drug: "antiplatelet agent"
- Qualifier: "other"
- Drug: "aspirin"
- Condition: "allergy"
- Temporal: "history of"
- Observation: "bleeding risk"
- Qualifier: "High"
- Measurement: "platelets"
- Value: "<50,000 / mm3"
- Measurement: "Hb"
- Value: "<8.5 g / dL"
- Condition: "intracranial hemorrhage"
- Condition: "subdural hematoma"
- Procedure: "major surgery,"
- Procedure: "parenchymal organ biopsy"
- Condition: "trauma"
- Qualifier: "severe"
- Temporal: "within 30 days"
- Qualifier: "active"
- Condition: "gastrointestinal ulcer"
- Temporal: "last 3 months"
- Temporal: "History of"
- Condition: "Stroke"
- Temporal: "in the last 3 months"
- Qualifier: "Moderate"
- Qualifier: "severe"
- Condition: "liver affection"
- Qualifier: "associated with coagulopathy"
- Condition: "coagulopathy"
- Qualifier: "Active"
- Condition: "infectious endocarditis"
- Temporal: "Active"
- Qualifier: "Active"
- Temporal: "Active"
- Condition: "tumor"
- Procedure: "treated"
- Temporal: "at the time of inclusion"
- Measurement: "expected survival"
- Value: "less than one year"